Clinical trial inclusion criterion:
12. Total serum bilirubin ≤1.5 × ULN

Annotated entities:
- Measurement: "Total serum bilirubin"
- Value: "≤1.5 × ULN"